previous repair of pectus excavatum by any technique

The above is a clinical trial exclusion criterion. Annotated with entity spans:
[Temporal: previous] [Procedure: repair of pectus excavatum] by any technique